Un hombre de 41 años acude a Urgencias por un cuadro de tres días de evolución de tumefacción y dolor en la rodilla derecha, con impotencia funcional y febrícula. Dos semanas antes había tenido un cuadro de diarrea autolimitada. En la exploración existe derrame articular, por lo que se procede a realizar una artrocentesis y se obtienen 50 cc de líquido de color turbio, con viscosidad disminuida y los siguientes parámetros analíticos: leucocitos 40.000/microL (85% de neutrófilos), glucosa 40 mg/dL, ausencia de cristales, tinción de Gram: no se observan microorganismos. ¿Cuál de las siguientes afirmaciones sobre este paciente es INCORRECTA?:
1. Se debe iniciar tratamiento con cloxacilina y ceftriaxona en espera del resultado del cultivo del líquido.
2. Es aconsejable realizar artrocentesis diarias para aliviar los síntomas y evitar la destrucción articular.
3. Si el cultivo es negativo, es probable que se trate de una artritis reactiva.
4. La negatividad de la tinción de Gram descarta que se trate de una artritis séptica.

Respuesta correcta: 4. La negatividad de la tinción de Gram descarta que se trate de una artritis séptica.